下列身體對血糖下降的反應，何者最先發生？
A. 胰島素分泌減少
B. 昇糖素分泌增加
C. 低血糖症狀
D. 認知（cognition）力變差

正確答案：A. 胰島素分泌減少